Treated with hydroxyurea within 30 days;

The above is a clinical trial exclusion criterion. Annotated with entity spans:
Treated with [Drug: hydroxyurea] [Temporal: within 30 days];